某班護理系學生 50 名參加內外科護理及精神科護理兩科測驗，其中內外科護理的全班平均分數為 78 分、標準差為 8 分，精神科護理的全班平均分數為 70 分、標準差為 8 分。該兩科目測驗分數之變異係數值（coefficient of variation）為：
A. 內外科護理＝精神科護理
B. 內外科護理＞精神科護理
C. 內外科護理＜精神科護理
D. 資訊不足無法判定

正確答案：C. 內外科護理＜精神科護理